allergy to any of the drugs used in this study

The above is a clinical trial exclusion criterion. Annotated with entity spans:
[Non-representable: allergy to any of the drugs used in this study]